Clinical trial exclusion criteria:
Cardio-vascular pathologies, evoluting and uncontrolled, (severe HTA), cardiac deficiency, severe angor, severe arrhythmia.
Infectious pathologies evoluting and requiring antibiotherapy.
Patients HIV+.
Transplanted patients or patients suffering from severe auto-immune disease.
Psychiatric troubles that do not allow the protocol follow-up.
Pregnant or breast-feeding women.
No contraception.

Annotated entities:
- Condition: "Cardio-vascular pathologies"
- Qualifier: "uncontrolled"
- Qualifier: "evoluting"
- Condition: "HTA"
- Qualifier: "severe"
- Condition: "cardiac deficiency"
- Condition: "angor"
- Condition: "arrhythmia"
- Qualifier: "severe"
- Qualifier: "severe"
- Condition: "Infectious pathologies"
- Qualifier: "evoluting"
- Qualifier: "requiring antibiotherapy"
- Drug: "antibiotherapy"
- Measurement: "HIV"
- Value: "+"
- Condition: "HIV+"
- Procedure: "Transplanted"
- Condition: "severe auto-immune disease"
- Condition: "Psychiatric troubles"
- Qualifier: "do not allow the protocol follow-up"
- Condition: "Pregnant"
- Condition: "breast-feeding"
- Person: "women"
- Procedure: "contraception"
- Negation: "No"